Clinical trial inclusion criterion:
Predicted adult height (based on bone age) more than 10 cm below target height (mid parental height)

Entity relations:
- Has_qualifier("Predicted adult height", "bone age")
- Has_value("Predicted adult height", "more than 10 cm below target height")
- Has_qualifier("more than 10 cm below target height", "mid parental height")